Pregnant women

The above is a clinical trial exclusion criterion. Annotated with entity spans:
[Condition: Pregnant] [Person: women]